Clinical trial exclusion criterion:
Radiographic signs of osteoarthritis (> Tonis grade 1)

Annotated entities:
- Mood: "Radiographic signs"
- Procedure: "Radiographic"
- Condition: "osteoarthritis"
- Measurement: "Tonis grade"
- Value: "> 1"